8. Patients with active systemic infections

The above is a clinical trial exclusion criterion. Annotated with entity spans:
[Parsing_Error: 8.] Patients with [Temporal: active] [Condition: systemic infections]